Clinical trial inclusion criterion:
Age = 18 years.

Entity relations:
- Has_value("Age", "= 18 years")